Clinical trial exclusion criterion:
reversible aetiology for agitation (e.g. hypotension, hypoxia, hypoglycaemia)

Annotated entities:
- Condition: "reversible aetiology"
- Condition: "agitation"
- Condition: "hypotension"
- Condition: "hypoxia"
- Condition: "hypoglycaemia"